Observar que los líquidos procedentes de la síntesis de cloroquina tenían una actividad antibacteriana dio lugar al descubrimiento de las quinolonas. Este grupo de antibióticos presenta diversas características como por ejemplo:
1. Las fluoroquinolonas presentan un espectro de actividad más reducido que las quinolonas de primera generación.
2. Las quinolonas de segunda generación son muy efectivas frente a anaerobios.
3. Las fluoroquinolonas no son efectivas frente a enterobacterias.
4. Las fluoroquinolonas son efectivas frente a grampositivos pero menos que frente a los gramnegativos.
5. Las fluoroquinolonas de tercera y cuarta generación no son efectivas frente a estreptococos o estafilococos.

Respuesta correcta: 4. Las fluoroquinolonas son efectivas frente a grampositivos pero menos que frente a los gramnegativos.